一位高血壓腦內出血（hypertensive intracerebral hemorrhage）的病人，臨床症狀出現嚴重的一側感覺喪失及輕微的運動功能損害，推斷最有可能的出血位置在何處？
A. 橋腦（pons）
B. 小腦（cerebellum）
C. 視丘（thalamus）
D. 殼核（putamen）

正確答案：C. 視丘（thalamus）